Clinical trial exclusion criterion:
Subject is morbidly obese (defined as a body mass index >40, or weighs more than 100 lbs over ideal body weight).

Entity relations:
- Has_value("body mass index", ">40")
- Has_value("weighs", "more than 100 lbs over ideal body weight")
- Subsumes("morbidly obese", "body mass index")
- OR("body mass index", "weighs")